有關醫療人員的守密義務，下列敘述何者錯誤？
A. 有助於醫病之間的信任，從而達到良好的醫病關係
B. 病患隱私與尊重自主原則息息相關
C. 希波克拉底誓詞中即強調醫師的守密義務
D. 我國醫療法與刑法明確規定醫療人員之守密義務，不容許例外情形

正確答案：D. 我國醫療法與刑法明確規定醫療人員之守密義務，不容許例外情形